Ability to provide informed consent

The above is a clinical trial inclusion criterion. Annotated with entity spans:
[Informed_consent: Ability to provide informed consent]